Being treated for hypercholesterolemia Being treated for hypertension Being treated for diabetes mellitus Being treated for peripheral vascular disease

The above is a clinical trial inclusion criterion. Annotated with entity spans:
Being [Procedure: treated for hypercholesterolemia] Being [Procedure: treated for hypertension] Being [Procedure: treated for diabetes mellitus] Being [Procedure: treated for peripheral vascular disease]